Which drugs are included in the VAC regiment for Ewing's sarcoma?

VAC regiment for Ewing's sarcoma includes vincristine, actinomycin, cyclophosphamide.